胎兒娩出後，胎盤無法自行娩出，並出現子宮大出血狀況，應優先採取下列那一項處置方式？
A. 以紗布填塞子宮及陰道
B. 等待胎盤自行子宮剝離
C. 子宮按摩並用人工剝離胎盤
D. 以胎盤	夾取出子宮內胎盤

正確答案：C. 子宮按摩並用人工剝離胎盤